What is the function of the chromHMM software?

The ChromHMM software is a tool for learning chromatin-state signatures. It allows you to learn chromatin states, and then use that knowledge to make an annotated chromatin state for each cell type.